Clinical trial exclusion criterion:
6. Oral steroids unless patients present a low stable dose (e.g. 10 mg or less of prednisone per day or physiological doses, less than 35 mg/day, of hydrocortisone Cortef®). Inhale steroids at stable dose in the last month are acceptable.

Annotated entities:
- Parsing_Error: "6."
- Drug: "Oral steroids"
- Negation: "unless"
- Qualifier: "stable dose"
- Qualifier: "low dose"
- Multiplier: "10 mg or less per day"
- Drug: "prednisone"
- Multiplier: "physiological doses"
- Multiplier: "less than 35 mg/day"
- Drug: "hydrocortisone"
- Drug: "Cortef"
- Grammar_Error: "Inhale steroids at stable dose in the last month are acceptable"
- Drug: "Inhale steroids"
- Qualifier: "stable dose"
- Temporal: "in the last month"